Clinical trial exclusion criterion:
Patient with Hepatitis B Virus (HBV), Hepatitis C Virus (HCV) and Human Immunodeficiency Virus (HIV) infections

Entity relations:
- Subsumes("Hepatitis B Virus infections", "HBV")
- Subsumes("Hepatitis C Virus infections", "HCV")
- Subsumes("Human Immunodeficiency Virus infections", "HIV")
- OR("Hepatitis B Virus infections", "Hepatitis C Virus infections", "Human Immunodeficiency Virus infections")